Clinical trial inclusion criterion:
5. self-reported failure of at least 2 of the 3 most common treatments for AT (NSAIDS, rest/ice or taping)

Annotated entities:
- Observation: "self-reported"
- Condition: "failure of at least 2 of the 3 most common treatments for AT"
- Drug: "NSAIDS"
- Procedure: "rest"
- Drug: "ice"
- Procedure: "taping"